Clinical indication for statins for primary or secondary prevention of cardiovascular disease or dyslipidaemia, on either no medication or non-statin lipid lowering therapy (e.g, ezetimibe)

The above is a clinical trial inclusion criterion. Annotated with entity spans:
Clinical [Condition: indication] for [Drug: statins] for [Qualifier: primary] or [Qualifier: secondary] [Observation: prevention of cardiovascular disease] or [Condition: dyslipidaemia], on either no medication or non-statin lipid lowering therapy (e.g, ezetimibe)